Clinical trial exclusion criterion:
15. History of malignancy within the last 5 years, except nonmelanoma skin cancer and cervical carcinoma in situ treated with curative intent.

Annotated entities:
- Parsing_Error: "15."
- Condition: "malignancy"
- Undefined_semantics: "malignancy"
- Temporal: "within the last 5 years"
- Temporal: "History"
- Condition: "nonmelanoma skin cancer"
- Negation: "except"
- Condition: "cervical carcinoma in situ"
- Procedure: "treated"
- Qualifier: "curative intent"